Contraindication for baclofen or toxin

The above is a clinical trial exclusion criterion. Annotated with entity spans:
[Condition: Contraindication] for [Drug: baclofen] or [Drug: toxin]